Clinical trial exclusion criterion:
5. Women with a history of PCOS

Annotated entities:
- Parsing_Error: "5."
- Person: "Women"
- Condition: "PCOS"
- Temporal: "history"